Estimated weight loss less than or equal to 10% in the 3 months before study randomization

The above is a clinical trial inclusion criterion. Annotated with entity spans:
[Measurement: Estimated weight loss] [Value: less than] or [Value: equal to 10%] in the [Temporal: 3 months before study randomization]